Clinical trial inclusion criteria:
All children scheduled for outpatient MRI scans with expected duration of scan between 30 minutes and 75 minutes.

Annotated entities:
- Qualifier: "outpatient"
- Procedure: "MRI scans"
- Measurement: "expected duration of scan"
- Value: "between 30 minutes and 75 minutes"